Clinical diagnosis of diabetic nephropathy, with a urinary albumin/creatinine ratio >30 mg/g and an estimated glomerular filtration rate more than 20 ml/min per 1.73 m2.

The above is a clinical trial inclusion criterion. Annotated with entity spans:
Clinical diagnosis of [Condition: diabetic nephropathy], with a [Measurement: urinary albumin/creatinine ratio] [Value: >30 mg/g] and an [Measurement: estimated glomerular filtration rate] [Value: more than 20 ml/min per 1.73 m2].